Clinical trial inclusion criteria:
patient 18 years old and more
with multiple sclerosis according to the criteria of Mac Donald 2010 : relapsing-remitting (RR), secondary-progressive (SP) or primary-progressive (PP)
for which treatment with dimethyl-fumarate has been prescribed
followed at the Rothschild Foundation in the Neurology Department
having given written consent to participation in the study

Annotated entities:
- Person: "old"
- Value: "and more 18 years"
- Condition: "multiple sclerosis"
- Measurement: "criteria of Mac Donald 2010"
- Qualifier: "relapsing-remitting"
- Qualifier: "RR"
- Qualifier: "secondary-progressive"
- Qualifier: "SP"
- Qualifier: "primary-progressive"
- Qualifier: "PP"
- Drug: "dimethyl-fumarate"
- Visit: "Rothschild Foundation in the Neurology Department"
- Informed_consent: "having given written consent to participation in the study"